Describe the mechanism of action of Luspatercept.

Luspatercept is a recombinant soluble activin type-II receptor-IgG-Fc fusion protein that blocks transforming growth factor beta (TGF b) superfamily inhibitors of erythropoiesis. Luspatercept is tested for the treatment of various types of anemias.